Previous treatment with CPAP

The above is a clinical trial exclusion criterion. Annotated with entity spans:
[Temporal: Previous] [Procedure: treatment] with [Device: CPAP]